What is ferroptosis?

Ferroptosis is a newly defined iron-dependent, non-apoptotic mode of cell death with necrotic morphology. Ferroptosis is a new mode of regulated cell death, which is completely distinct from other cell death modes based on morphological, biochemical, and genetic criteria. Ferroptosis is a form of oxidative cell death and has become a chemotherapeutic target for cancer treatment